下列何者不是大腸直腸癌之危險因子？
A. 高動物性脂肪飲食
B. 發炎性腸道疾病（Inflammatory bowel disease）
C. 大腸息肉症（polyposis coli）
D. 荷爾蒙補充療法（Hormone replacement therapy）

正確答案：D. 荷爾蒙補充療法（Hormone replacement therapy）